Paediatric subjects aged =28 days (= 1 month) to <18 years, requiring non-emergent open hepatic, abdominal, retroperitoneal, pelvic or thoracic (non-cardiac) surgical procedures. i) The first 36 subjects to be enrolled will be subjects aged =1 years to <18 years. ii) The next 4 subjects to be enrolled will be subjects aged =28 days to <1 year.

The above is a clinical trial inclusion criterion. Annotated with entity spans:
Paediatric subjects [Person: aged] [Value: =28 days (= 1 month) to <18 years], requiring [Qualifier: non-emergent] [Qualifier: open] [Qualifier: hepatic], [Qualifier: abdominal], [Qualifier: retroperitoneal], [Qualifier: pelvic] or [Qualifier: thoracic] ([Qualifier: non-cardiac]) [Procedure: surgical procedures]. i) [Non-query-able: The first 36 subjects to be enrolled will be subjects aged =1 years to <18 years. ii) The next 4 subjects to be enrolled will be subjects aged =28 days to <1 year].